Clinical trial inclusion criterion:
All patients will be undergoing a primary unilateral total knee arthroplasty for a diagnosis of osteoarthritis

Annotated entities:
- Condition: "osteoarthritis"
- Procedure: "unilateral total knee arthroplasty"
- Qualifier: "primary"